Willing and able to participate after the study has been explained

The above is a clinical trial inclusion criterion. Annotated with entity spans:
[Non-query-able: Willing and able to participate after the study has been explained]